Clinical trial exclusion criterion:
12. Participation in an rTMS session less than two weeks ago.

Annotated entities:
- Parsing_Error: "12."
- Procedure: "rTMS session"
- Temporal: "less than two weeks ago"